En los linfocitos T, ¿cuál de las siguientes moléculas tiene actividad coestimuladora?:
1. VCAM-1.
2. ICAM-1.
3. B7-1.
4. LFA-1.

Respuesta correcta: 3. B7-1.